La base de la teoría de Watson es la práctica enfermera centrada en:
1. Las 10 necesidades fundamentales.
2. Los 10 factores de cuidados.
3. Los 8 requisitos de autocuidado.
4. Los 4 modos de adaptación.
5. Los 21 problemas de enfermería.

Respuesta correcta: 2. Los 10 factores de cuidados.